Previous uterine surgery.

The above is a clinical trial exclusion criterion. Annotated with entity spans:
Previous [Procedure: uterine surgery].